What is the asosciation between the eustachian tube and the palatine muscle of the uvula?

Palatal musculature is known to be responsible for the active opening of the eustachian tube.